planning to move in next 12-24 months

The above is a clinical trial exclusion criterion. Annotated with entity spans:
[Mood: planning to move] [Temporal: in next 12-24 months]